Clinical trial inclusion criterion:
Stable tacrolimus dose for at least 2 weeks prior to randomization

Annotated entities:
- Drug: "tacrolimus"
- Temporal: "for at least 2 weeks prior to randomization"
- Reference_point: "randomization"
- Qualifier: "Stable dose"